Clinical trial exclusion criterion:
Platelets = 50,000/mm3

Annotated entities:
- Measurement: "Platelets"
- Value: "= 50,000/mm3"